La adenohipófisis:
1. Es parte del hipotálamo.
2. Está regulada hormonalmente.
3. Se comunica con la neurohipófisis.
4. Libera ADH y oxitocina.
5. Está formada por neuronas.

Respuesta correcta: 2. Está regulada hormonalmente.